Clinical trial inclusion criterion:
Chronic hepatitis B (HBsAg positive > 6 months)

Annotated entities:
- Condition: "Chronic hepatitis B"
- Measurement: "HBsAg"
- Value: "positive"
- Temporal: "> 6 months"